Be at least 21 years of age.

The above is a clinical trial inclusion criterion. Annotated with entity spans:
Be [Value: at least 21 years] of [Person: age].